Clinical trial inclusion criterion:
Newly-diagnosed gynecologic cancer patients in whom SLN mapping and surgical excision is indicated OR

Entity relations:
- AND("SLN mapping is indicated", "SLN mapping")
- AND("surgical excision is indicated", "surgical excision")